Clinical trial exclusion criterion:
8. Subjects who plan to have cardiac transplantation;

Entity relations:
- Has_mood("cardiac transplantation", "plan")